Clinical trial exclusion criterion:
Pregnant, nursing, or not using effective methods of birth control

Annotated entities:
- Condition: "Pregnant"
- Condition: "nursing"
- Negation: "not"
- Procedure: "birth control"
- Qualifier: "effective methods"